¿En qué dimensión se incluye la impulsividad en el modelo de los Cinco Grandes?:
1. Neuroticismo.
2. Extraversión.
3. Responsabilidad.
4. Amabilidad.

Respuesta correcta: 1. Neuroticismo.